Clinical trial inclusion criterion:
Stable or unstable angina, including non ST-segment-elevation acute coronary syndrome (NSTE-ACS)

Entity relations:
- Subsumes("non ST-segment-elevation acute coronary syndrome", "NSTE-ACS")
- Subsumes("unstable angina", "non ST-segment-elevation acute coronary syndrome")
- OR("Stable angina", "unstable angina")